下列何種症狀或徵候（symptoms and/or signs）通常是在慢性隅角開放型青光眼的末期才出現？
A. 視力模糊
B. 視野缺損（visual field defect）
C. 視神經盤凹陷（disc cupping）變大
D. 視網膜神經纖維層（retinal nerve fiber layer）的變化

正確答案：A. 視力模糊